Clinical trial inclusion criterion:
Patient is currently benefiting from the treatment with ruxolitinib, as determined by the investigator

Annotated entities:
- Drug: "ruxolitinib"
- Non-query-able: "Patient is currently benefiting from the treatment with ruxolitinib, as determined by the investigator"